4. Subject is an acceptable candidate for elective, urgent or emergency coronary artery bypass graft (CABG).

The above is a clinical trial inclusion criterion. Annotated with entity spans:
4. Subject is an acceptable candidate for [Qualifier: elective], [Qualifier: urgent] or [Qualifier: emergency] [Condition: coronary artery bypass graft (CABG)].